Clinical trial exclusion criterion:
Intubated patients (prior to randomization)

Annotated entities:
- Condition: "Intubated"
- Temporal: "prior to randomization"
- Reference_point: "randomization"